Clinical trial inclusion criterion:
Diagnosed or told by a clinician that they have any of the following bipolar spectrum disorders (BSD): bipolar I, bipolar II, unspecified bipolar and related disorders, Disruptive Mood Dysregulation Disorder (DMDD), cyclothymic disorder, other specified bipolar and related disorders, as well as mood disorder not otherwise specified (if diagnosed in the past as per DSM-IV);

Annotated entities:
- Condition: "bipolar spectrum disorders"
- Condition: "BSD"
- Condition: "bipolar I"
- Condition: "bipolar II"
- Condition: "unspecified bipolar and related disorders"
- Condition: "Disruptive Mood Dysregulation Disorder"
- Condition: "DMDD"
- Condition: "cyclothymic disorder"
- Condition: "other specified bipolar and related disorders"
- Condition: "mood disorder not otherwise specified"